33 歲女性，G1P0，目前懷孕 30 週，因突發性大量陰道水樣液體流出及腹部疼痛至產房檢查。孕婦意識清醒，血壓 130/80 mmHg，耳溫 37℃，胎心音每分鐘 130 下，超音波檢查發現羊水指數（AFI： amnionic fluid index）為 2，無前置胎盤，最可能的診斷為：
A. 泌尿道感染合併尿失禁
B. 早產早期破水
C. 胎盤早期剝離
D. 陰道感染

正確答案：B. 早產早期破水